Known acute pancreatitis or known severe hepatic dysfunction, including hepatic failure, cirrhosis, portal hypertension (oesophageal varices) and active hepatitis

The above is a clinical trial exclusion criterion. Annotated with entity spans:
Known [Condition: acute pancreatitis] or known [Qualifier: severe] [Condition: hepatic dysfunction], including [Condition: hepatic failure], [Condition: cirrhosis], [Condition: portal hypertension] ([Condition: oesophageal varices]) and [Condition: active hepatitis]